下列關於第一型人類免疫缺乏病毒（HIV-1）藥物治療之敘述，何者錯誤？
A. 單一藥物治療失敗的主要原因之一是 HIV-1 有高突變率可以很快產生抗藥性
B. 非核苷反轉錄抑制劑（non-nucleoside reverse transcriptase inhibitor）不抑制反轉錄的步驟
C. 蛋白抑制劑（protease inhibitor）主要抑制病毒體的形成（morphogenesis）
D. 所謂雞尾酒療法是一種混合性療法

正確答案：B. 非核苷反轉錄抑制劑（non-nucleoside reverse transcriptase inhibitor）不抑制反轉錄的步驟